Clinical trial exclusion criterion:
clinical evidence of current malignancy with exception of basal cell or squamous cell carcinoma of the skin, and cervical intraepithelial neoplasia (5 years prior to randomization)

Annotated entities:
- Condition: "malignancy"
- Negation: "exception"
- Condition: "basal cell carcinoma of the skin"
- Condition: "squamous cell carcinoma of the skin"
- Condition: "cervical intraepithelial neoplasia"
- Temporal: "5 years prior to randomization"
- Reference_point: "randomization"